有關阻塞性睡眠呼吸中止症（obstructive sleep apnea, OSA）的敘述，下列何者錯誤？
A. 主要是靠肺量計（spirometry）和腦波圖來診斷
B. 肥胖者與OSA的發生有密切關係
C. 容易有打鼾、白天嗜睡及夜間睡眠呼吸中斷等症狀
D. 治療以睡眠時佩戴正壓呼吸器（continuous positive airway pressure）為主

正確答案：A. 主要是靠肺量計（spirometry）和腦波圖來診斷